Clinical trial inclusion criterion:
Score 26 or higher on the Montreal Cognitive Assessment

Annotated entities:
- Measurement: "Montreal Cognitive Assessment"
- Value: "26 or higher"